Clinical trial exclusion criterion:
School districts in the 2 urban regions of the study area

Annotated entities:
- Visit: "School districts in the 2 urban regions of the study area"